List approved radioprotective compounds

Only two radioprotective compounds, amifostine and palifermin, currently have the US FDA approval for use in radiation therapy.